List inhibtors targeting the mitochondrial permeability transition pore.

Cyclosporine A
Atractyloside
N-metyl-4-isoleucine-cyclosporine
Sanglifehrin A 
TRO-19622